Clinical trial exclusion criterion:
Polytrauma; undergoing other surgeries or having other orthopedic injuries related to the precipitating cause of the ankle fracture

Entity relations:
- AND("other orthopedic injuries", "ankle fracture")
- OR("other surgeries", "other orthopedic injuries")